Los organometálicos reaccionan con los nitrilos dando:
1. Aminoácidos.
2. Lactonas.
3. Alcoholes.
4. Cetonas.
5. Ninguna de las anteriores.

Respuesta correcta: 4. Cetonas.